Clinical trial exclusion criterion:
Any confirmed or suspected immunosuppressive or immunodeficient condition, based on medical history and physical examination (no laboratory testing required).

Annotated entities:
- Condition: "immunosuppressive condition"
- Condition: "immunodeficient condition"
- Qualifier: "confirmed"
- Qualifier: "suspected"